Trial of < 2 AEDs

The above is a clinical trial exclusion criterion. Annotated with entity spans:
Trial of [Multiplier: < 2] [Drug: AEDs]